根據醫療管理常運用之 SWOT 評估醫院的優、劣勢、機會與威脅，下列何項指標無法用於評量醫院之優、劣勢？
A. 創新
B. 品質
C. 環境競爭程度
D. 效率

正確答案：C. 環境競爭程度